Clinical trial exclusion criteria:
Any contraindication to neuraxial anesthesia (history of neurologic disease (e.g., multiple sclerosis, spinal stenosis, central or peripheral neuropathy)
Pre-existing/chronic back pain
Ester local anesthetic allergy, PABA allergy
History of atypical cholinesterase (CP is metabolized by cholinesterase)

Annotated entities:
- Condition: "contraindication"
- Drug: "neuraxial anesthesia"
- Temporal: "history"
- Condition: "neurologic disease"
- Condition: "multiple sclerosis"
- Condition: "spinal stenosis"
- Condition: "central neuropathy"
- Condition: "peripheral neuropathy"
- Qualifier: "chronic"
- Temporal: "Pre-existing"
- Condition: "back pain"
- Drug: "Ester local anesthetic"
- Condition: "allergy"
- Drug: "PABA"
- Condition: "allergy"
- Temporal: "History"
- Drug: "atypical cholinesterase"
- Non-representable: "CP is metabolized by cholinesterase"